Clinical trial exclusion criterion:
Intends to donate eggs (female participants) or sperm (male participants) while receiving trial medication or within 6 months after trial medication

Annotated entities:
- Procedure: "donate eggs"
- Procedure: "donate sperm"
- Person: "female"
- Person: "male"
- Temporal: "while receiving trial medication"
- Temporal: "within 6 months after trial medication"
- Reference_point: "trial medication"
- Reference_point: "trial medication"